Self-identified history of hypoglycemia

The above is a clinical trial exclusion criterion. Annotated with entity spans:
[Qualifier: Self-identified] [Temporal: history] of [Condition: hypoglycemia]